Clinical trial inclusion criteria:
>18 to < 90 years old
Both sexes
Mild to moderate tear film dysfunction clinical diagnose
TBUT > 5 sec. and < 10 sec.
Schirmer: > 4 mm and < 14 mm
OSDI < 30 points
Corneal staining < grade III on the Oxford scale
Availability to go to each revision when indicated.

Annotated entities:
- Person: "old"
- Value: ">18 to < 90 years"
- Person: "Both sexes"
- Qualifier: "moderate"
- Qualifier: "Mild"
- Condition: "tear film dysfunction"
- Measurement: "TBUT"
- Value: "> 5 sec. and < 10 sec"
- Measurement: "Schirmer"
- Value: "> 4 mm and < 14 mm"
- Measurement: "OSDI"
- Value: "< 30 points"
- Condition: "Corneal staining"
- Qualifier: "< grade III"
- Qualifier: "Oxford scale"
- Qualifier: "Oxford scale"
- Post-eligibility: "Availability to go to each revision when indicated."